Patient diagnosed with dementia.

The above is a clinical trial exclusion criterion. Annotated with entity spans:
Patient diagnosed with [Condition: dementia].